Clinical trial exclusion criterion:
history of ketoacidosis or metabolic acidosis

Annotated entities:
- Condition: "ketoacidosis"
- Condition: "metabolic acidosis"